Clinical trial inclusion criterion:
Age over 18 years

Annotated entities:
- Person: "Age"
- Value: "over 18 years"